Clinical trial inclusion criterion:
10. MRI finding of sacral perineurial cysts, but without any clinical symptoms, included in the negative control group

Annotated entities:
- Non-query-able: "MRI finding of sacral perineurial cysts, but without any clinical symptoms, included in the negative control group"